Clinical trial inclusion criterion:
Be able to speak, read and write English and follow simple instructions for completing self-rated scales

Annotated entities:
- Observation: "able to speak, read and write English"
- Observation: "able to follow simple instructions"